Foot ulcer duration more than 6 weeks

The above is a clinical trial inclusion criterion. Annotated with entity spans:
[Condition: Foot ulcer] duration [Temporal: more than 6 weeks]